Patient suffers with other cardiac rhythm disorders.

The above is a clinical trial exclusion criterion. Annotated with entity spans:
Patient suffers with [Qualifier: other] [Condition: cardiac rhythm disorders].